李先生並無高血壓病史且平常在家中測量的血壓值約為 120/70 mmHg。本次回診的血壓值為 140/92 mmHg。就美國糖尿病學會對血壓控制標準值的建議為 130/80 mmHg 以下，下列何者是處理李先生血壓問題的最佳方式？
A. 請李先生在家中多量幾次血壓
B. 請李先生減少鹽分的攝取
C. 請李先生先增加運動的時段
D. 給予李先生血管收縮素轉化酶抑制劑（angiotensin-converting enzyme inhibitor）或血管收縮素 II 受體阻斷劑（angiotensin II receptor blocker）藥物

正確答案：A. 請李先生在家中多量幾次血壓